Clinical trial exclusion criterion:
any condition that in the opinion of the attending physician could endanger the health of the participant or render her unsuitable to participate in the trial

Annotated entities:
- Non-query-able: "any condition that in the opinion of the attending physician could endanger the health of the participant or render her unsuitable to participate in the trial"